威而鋼（Viagra）是 cGMP phosphodiesterase 的抑制劑，其作用為維持：
A. 高活性的 G protein
B. 高濃度的 cGMP
C. 低活性的 G protein
D. 低濃度的 cGMP

正確答案：B. 高濃度的 cGMP